Clinical trial exclusion criterion:
GFR < 40 ml/min/1.73m2 as measured by the MDRD formula

Entity relations:
- Has_qualifier("< 40 ml/min/1.73m2", "MDRD formula")